Clinical trial exclusion criterion:
History of heart transplant or on a transplant list or with left ventricular (LV) assistance device.

Annotated entities:
- Procedure: "heart transplant"
- Temporal: "History"
- Mood: "on a transplant list"
- Device: "left ventricular (LV) assistance device"